Clinical trial exclusion criterion:
Women who are pregnant or breastfeeding

Annotated entities:
- Person: "Women"
- Observation: "pregnant"
- Observation: "breastfeeding"